Advanced male factor infertility.

The above is a clinical trial exclusion criterion. Annotated with entity spans:
[Qualifier: Advanced] [Condition: male factor infertility].